一位50歲女性因右眼紅、疼痛至急診室就診，下列敘述何者不恰當？
A. 若上眼瞼（eyelid）處發現小水皰，則須照會眼科醫師觀察角膜是否有病變
B. 若鼻尖發現小水皰，則表示鼻睫神經（nasociliary nerve）受到侵犯
C. 眼睛疼痛嚴重度是治療成效的指標，故不宜使用眼睛局部止痛劑
D. 若懷疑皰疹病毒感染，可使用紅黴素（erythromycin）預防二次細菌性感染

正確答案：C. 眼睛疼痛嚴重度是治療成效的指標，故不宜使用眼睛局部止痛劑